Clinical trial exclusion criterion:
Past history of breast cancer within recent 5 years before the currently diagnosed breast cancer.

Annotated entities:
- Condition: "breast cancer"
- Temporal: "recent 5 years before the currently diagnosed breast cancer"
- Reference_point: "currently diagnosed breast cancer."